Clinical trial exclusion criterion:
Any significant co-morbidities, such as active heart, kidney, or liver diseases, accelerated or malignant hypertension, heart failure, severe anemia.

Entity relations:
- Has_qualifier("co-morbidities", "significant")
- Has_qualifier("liver diseases", "active")
- Has_qualifier("hypertension", "accelerated")
- Subsumes("co-morbidities", "liver diseases")
- OR("accelerated", "malignant")
- OR("liver diseases", "diseases kidney", "hypertension", "heart failure", "severe anemia", "diseases heart")